78歲女性患有高血壓、慢性腎功能不全、陳舊性中風，長期使用導尿管，居住在慢性養護機構；因發高燒兩天，消化不佳，解黑便及意識不清，住院治療。經檢查發現血液和尿液培養皆長出：具有廣效乙內醯胺酵素 （extended-spectrum beta-lactamase，ESBL）之大腸桿菌（Escherichia coli），下列抗生素藥物治療及投與途徑，何者最適合用於治療初期？
A. oral cephalexin
B. intravenous cefotaxime
C. intravenous ertapenem
D. intramuscular gentamicin

正確答案：C. intravenous ertapenem